Clinical trial inclusion criterion:
Elevated liver enzymes at baseline blood test

Annotated entities:
- Value: "Elevated"
- Measurement: "liver enzymes"
- Temporal: "baseline"
- Procedure: "blood test"